Clinical trial inclusion criterion:
First Diagnosed Head and neck cancer and plan for treatment with cisplatin

Entity relations:
- Has_mood("cisplatin", "plan")
- AND("Head and neck cancer", "cisplatin")